Si en un estudio epidemiológico, la población participante tiene como criterio de inclusión la voluntariedad, la validez de los resultados están sometidos a un sesgo de:
1. Información.
2. Confusión.
3. Selección.
4. Interpretación.
5. Publicación.

Respuesta correcta: 3. Selección.